一位 7 歲大的男孩因近一個月來臉色蒼白、腹脹、活動力較差到門診求診，血液常規檢查結果如下： WBC：320,000/mm3（segment 2%；lymphocyte 25%；blast cell 72%）、RBC：2.30×106/mm3、Hb： 6.0 g/dL、血小板：10,000/mm3。身體診查發現肝臟及脾臟有腫大現象。他最不可能出現下列那一項血液檢查結果？
A. 尿酸（uric acid）：10 mg/dL
B. 鉀離子（K+）：6 mEq/L
C. 無機磷（phosphorus, inorganic）：8.6 mg/dL
D. 鈉離子（Na+）：155 mEq/L

正確答案：D. 鈉離子（Na+）：155 mEq/L